下列何者是屬於胃腺（gastric gland proper）的細胞？
A. 壁細胞（parietal cells）
B. 微皺襞細胞（M cells/microfold cells）
C. Paneth氏細胞（Paneth cells）
D. 杯狀細胞（goblet cells）

正確答案：A. 壁細胞（parietal cells）